有一新生兒出生後發現口腔分泌很多，X 光片看到胃很漲，鼻胃管卻放不進胃中，則最可能診斷為：
A. 肥厚性幽門阻塞（hyertrophic pyloric stenosis）
B. 食道閉鎖合併食道氣管廔管（esophageal atresia with tracheoesophageal fistula）
C. 鼻後孔阻塞（choanal atresia）
D. 聲帶麻痺（vocal cord paralysis）

正確答案：B. 食道閉鎖合併食道氣管廔管（esophageal atresia with tracheoesophageal fistula）